Clinical trial exclusion criterion:
patient known and treated for sleep apnea syndrome

Entity relations:
- AND("treated", "sleep apnea syndrome")